How early during pregnancy does non-invasive cffDNA testing allow sex determination of the fetus?

Using cffDNA from maternal blood, the fetal gender can be determined as early as 6 to 10 weeks of gestation (during the first trimester of pregnancy).